Preoperative complete parenteral or enteral feeding

The above is a clinical trial exclusion criterion. Annotated with entity spans:
[Temporal: Preoperative] [Condition: complete parenteral] or enteral feeding